Clinical trial exclusion criterion:
ASA IV-V

Entity relations:
- Has_value("ASA", "IV-V")